一名25歲女性業務員，過去身體狀況良好，無不良嗜好。近半年來在跑業務途中，已有七、八次於公車上突然發生呼吸困難、胸悶、手腳發麻、頭昏、心跳急促及有快要失控的感覺，因此變得害怕出門工作，整天擔心是否罹患不治之症。依據DSM-IV-TR診斷標準，此個案最有可能的診斷為何？
A. 急性壓力症候群（acute stress disorder）
B. 慮病症（hypochondriasis）
C. 社交畏懼症（social phobia）
D. 恐慌症（panic disorder）

正確答案：D. 恐慌症（panic disorder）